Clinical trial inclusion criteria:
Age =1 year, stratified into different age groups
Living in the Waya Clinic Catchment Area
Good health condition, without clinically significant medical history (by participant or guardian, in case of minor)
Not pregnant for female subjects.
Available to participate for the study duration, including all planned follow-up visits for up to 9 months from screening.
Signed informed consent

Annotated entities:
- Person: "Age"
- Value: "=1 year"
- Non-representable: "stratified into different age groups"
- Visit: "Waya Clinic Catchment Area"
- Person: "Living"
- Condition: "Good health condition"
- Negation: "without"
- Qualifier: "clinically significant"
- Temporal: "medical history"
- Negation: "Not"
- Condition: "pregnant"
- Person: "female"
- Post-eligibility: "Available to participate for the study duration, including all planned follow-up visits for up to 9 months from screening."
- Informed_consent: "Signed informed consent"